Clinical trial inclusion criterion:
Taking Kaletra containing regimen with suppressed viral load.

Entity relations:
- Has_value("viral load", "suppressed")
- AND("regimen", "Kaletra")